Clinical trial inclusion criterion:
Able to operate a patient-controlled analgesia device (PCA)

Entity relations:
- Subsumes("patient-controlled analgesia device", "PCA")